Clinical trial exclusion criterion:
Patients taking Clonidine

Annotated entities:
- Drug: "Clonidine"